一位 64 歲男性，長期吸菸，三年前開始出現運動性呼吸困難，近來氣促加重，兼有胸口悶痛，頭暈，身體診察：頸靜脈怒張，左下胸緣有 grade III/VI systolic murmur，P2 加重，合併有下肢水腫，請問最有可能的診斷是：
A. 縮窄性心包炎（constrictive pericarditis）
B. 限制性心肌病變（restrictive cardiomyopathy）
C. 肺心症（cor pulmonale）
D. 急性冠狀動脈症候群（acute coronary syndrome）

正確答案：C. 肺心症（cor pulmonale）